各種消化道平滑肌收縮模式中，那一種是大腸特有的平滑肌收縮？
A. peristaltic wave
B. segmentation contraction
C. tonic contraction
D. mass action contraction

正確答案：D. mass action contraction